Be allergic to amikacin

The above is a clinical trial exclusion criterion. Annotated with entity spans:
Be [Condition: allergic] to [Drug: amikacin]